Clinical trial exclusion criterion:
Currently taking more than three glucose lowering therapies

Annotated entities:
- Multiplier: "more than three"
- Procedure: "glucose lowering therapies"